Are there any tools that could predict protein structure considering amino acid sequence?

AlphaFold, PredictProtein, PSIPRED, Jpred and Porter do all predict protein stucture from amino acid sequence.